Clinical trial exclusion criterion:
Contraindications for BB.

Annotated entities:
- Condition: "Contraindications"
- Drug: "BB"